A positive 13 C-urea breath test

The above is a clinical trial inclusion criterion. Annotated with entity spans:
A [Value: positive] [Measurement: 13 C-urea breath test]